Must have at least 6 mm of residual bone

The above is a clinical trial inclusion criterion. Annotated with entity spans:
Must have [Value: at least 6 mm] of [Measurement: residual bone]